Patients must have adequate organ and marrow function

The above is a clinical trial inclusion criterion. Annotated with entity spans:
Patients must have [Value: adequate] [Measurement: organ] and [Measurement: marrow function]